Clinical trial inclusion criterion:
ability to read short messages on the mobile phone

Annotated entities:
- Post-eligibility: "ability to read short messages on the mobile phone"